Is between 18 and 40 years of age (inclusive)

The above is a clinical trial inclusion criterion. Annotated with entity spans:
Is [Value: between 18 and 40 years] of [Person: age] (inclusive)